Intolerance of pulsed corticosteroids, especially a history of steroid psychosis

The above is a clinical trial exclusion criterion. Annotated with entity spans:
[Condition: Intolerance] of [Drug: pulsed corticosteroids], especially a [Temporal: history of] [Condition: steroid psychosis]